History of a severe allergic reaction (e.g. anaphylaxis) to a previous dose of any hepatitis B vaccine

The above is a clinical trial exclusion criterion. Annotated with entity spans:
History of a [Qualifier: severe] [Condition: allergic reaction] (e.g. [Condition: anaphylaxis]) to a [Temporal: previous] dose of any [Drug: hepatitis B vaccine]